有關內耳（inner ear），下列敘述何項錯誤？
A. 內耳包括骨性與膜性迷路（bony and membranous labyrinth）
B. 內淋巴液（endolymph）充滿整個膜性迷路（membranous labyrinth）
C. 前庭膜（vestibular membrane）將中階（scala media）與前庭階（scala vestibuli）分開
D. 壺腹嵴（cristae ampullaris）感受直線加速運動（linear acceleration）及地心引力（gravity）

正確答案：D. 壺腹嵴（cristae ampullaris）感受直線加速運動（linear acceleration）及地心引力（gravity）